Current pregnancy

The above is a clinical trial exclusion criterion. Annotated with entity spans:
Current [Condition: pregnancy]